Clinical trial exclusion criterion:
Non diabetic nephropathy (confirmed by biopsy).

Entity relations:
- Has_qualifier("Non diabetic nephropathy", "confirmed by biopsy")
- multi("confirmed by biopsy", "biopsy")